Clinical trial inclusion criterion:
1. Subject is at least 18 years old.

Entity relations:
- Has_value("old", "at least 18 years")